11. Target lesions(s) is (are) located in an infarct (if not treated with primary PCI) or non-infarct-related artery with a 70% or greater stenosis (by visual estimate) more than 72 hours following the ST segment elevation myocardial infarction (STEMI).

The above is a clinical trial inclusion criterion. Annotated with entity spans:
11. [Condition: Target lesions](s) is (are) located [Qualifier: in an infarct] (if [Negation: not] treated with [Procedure: primary PCI]) or [Qualifier: non-infarct-related artery] with a [Value: 70% or greater] [Measurement: stenosis] (by visual estimate) [Temporal: more than 72 hours following the ST segment elevation myocardial infarction (STEMI)].